下列有關腦垂腺腫瘤之治療，何者錯誤？
A. 具有功能性之腫瘤皆要開刀治療
B. 腦垂腺腫瘤之開刀以 transsphenoidal 方式為主
C. 終身追蹤及處置是必要的
D. 放射線治療可避免再發

正確答案：A. 具有功能性之腫瘤皆要開刀治療